下列有關使用吸入性麻醉劑時，因血中腎上腺素增加而引起心律不整的敘述，何者錯誤？
A. 目前halothane仍然是腎上腺素敏感閾值（threshold）最低的藥物
B. sevoflurane和desflurane所需引發心律不整的血中最低腎上腺素濃度是差不多的
C. isoflurane比sevoflurane更容易引發這類的心律不整
D. 主要機制與心肌上的甲乙型腎上腺接受器（α1Aand β adrenoreceptor）無關

正確答案：D. 主要機制與心肌上的甲乙型腎上腺接受器（α1Aand β adrenoreceptor）無關